Clinical trial inclusion criteria:
age <2 years
indication of general anesthesia with tracheal intubation
inhalational induction scheduled
written informed consent of both parents

Annotated entities:
- Person: "age"
- Value: "<2 years"
- Procedure: "general anesthesia"
- Procedure: "tracheal intubation"
- Mood: "indication"
- Procedure: "inhalational induction"
- Mood: "scheduled"
- Informed_consent: "written informed consent of both parents"